Clinical trial exclusion criterion:
Use of anti-allergic with antigen injections in a maximum timeline of 14 days before the vaccination;

Annotated entities:
- Procedure: "antigen injections"
- Drug: "anti-allergic"
- Temporal: "maximum timeline of 14 days before the vaccination"
- Reference_point: "the vaccination"